那一種因基因異常引起之心律不整病人服用 mexiletine 易誘發心律不整之產生？
A. LQT-3 病人
B. Brugada Syndrome 病人
C. Familial atrial fibrillation 病人
D. LQT-2 病人

正確答案：B. Brugada Syndrome 病人